Clinical trial exclusion criterion:
Pregnant or nursing woman.

Annotated entities:
- Condition: "Pregnant"
- Condition: "nursing"
- Person: "woman"